En la valoración de una base fuerte con un ácido fuerte (a 25 ºC):
1. Antes del punto de equivalencia, el pH lo determina el exceso de H+ de la disolución.
2. Después del punto de equivalencia, el exceso de iones hidroxilo OH- que hay en la disolución determina el pH.
3. En el punto de equivalencia el pH es siempre 7, ya que lo determina la disociación del agua.
4. En el punto de equivalencia el pH es siempre ácido.
5. La constante de equilibrio de la reacción de valoración es muy baja, y se puede decir que la reacción “no es completa”.

Respuesta correcta: 3. En el punto de equivalencia el pH es siempre 7, ya que lo determina la disociación del agua.